Clinical trial exclusion criterion:
Preexistent chronic renal failure.

Annotated entities:
- Condition: "chronic renal failure"
- Temporal: "Preexistent"